Clinical trial inclusion criterion:
over 18 years of age

Entity relations:
- Has_value("age", "over 18 years")